Hypercoagulable state

The above is a clinical trial exclusion criterion. Annotated with entity spans:
[Condition: Hypercoagulable state]